have CAC between 10 to <1000, and

The above is a clinical trial inclusion criterion. Annotated with entity spans:
have [Measurement: CAC] [Value: between 10 to <1000], and